Clinical trial exclusion criterion:
Use of acetylsalicylic acid (ASA), antiplatelet agents within 7 days prior to surgery

Entity relations:
- Subsumes("acetylsalicylic acid", "ASA")
- Has_index("within 7 days prior to surgery", "surgery")
- Has_temporal("acetylsalicylic acid", "within 7 days prior to surgery")
- OR("acetylsalicylic acid", "antiplatelet agents")